Clinical trial inclusion criterion:
5. Suffers from at least two of the symptoms in the GLIA™ Glaucoma Medication Ocular Side Effect Symptoms Questionnaire at a severity of 2 (moderate) or more.

Entity relations:
- Subsumes("severity of 2 or more", "moderate")
- Has_value("GLIA™ Glaucoma Medication Ocular Side Effect Symptoms Questionnaire", "severity of 2 or more")
- Has_multiplier("symptoms", "at least two")
- AND("symptoms", "GLIA™ Glaucoma Medication Ocular Side Effect Symptoms Questionnaire")